Clinical trial exclusion criterion:
Patients with severe-complicated disease that would compromise oral therapy (hypotenstion or shock, ileus or bowel obstruction, megacolon).

Entity relations:
- OR("hypotenstion", "shock", "ileus", "bowel obstruction", "megacolon")